Clinical trial inclusion criterion:
Patients undergoing laparoscopic or robotic colorectal resections

Entity relations:
- Has_qualifier("colorectal resections", "laparoscopic")
- OR("laparoscopic", "robotic")